Clinical trial inclusion criterion:
NYHA IV:Unable to carry on any physical activity without discomfort. Symptoms at rest can be present. If any physical activity is undertaken, discomfort increased.

Annotated entities:
- Non-query-able: "NYHA IV:Unable to carry on any physical activity without discomfort. Symptoms at rest can be present. If any physical activity is undertaken, discomfort increased"